Clinical trial inclusion criterion:
Women between 40 to 70 years of age.

Entity relations:
- Has_value("age", "between 40 to 70 years")